Clinical trial inclusion criterion:
Patients over the age of 18 years who are able to give their informed consent

Annotated entities:
- Person: "over the age of 18 years"
- Observation: "able to give their informed consent"